Clinical trial inclusion criterion:
Has an indication for implantation of a single or dual chamber ICD or CRT-D system in their respective geography

Annotated entities:
- Observation: "indication"
- Procedure: "chamber ICD implantation of a single"
- Procedure: "dual chamber ICD implantation of a"
- Procedure: "CRT-D system implantation of a"